進行吞嚥動作時，下列何項動作錯誤？
A. 舌頭提升（elevation of the tongue）
B. 舌頭後移（posterior movement of the tongue）
C. 軟顎下降（depression of soft palate）
D. 舌骨上升（elevation of the hyoid）

正確答案：C. 軟顎下降（depression of soft palate）